Clinical trial exclusion criterion:
Active medical conditions with known mood changes (endocrine, autoimmune disorders).

Entity relations:
- OR("endocrine disorders", "autoimmune disorders")